Clinical trial exclusion criterion:
Vulnerable patients (Patient referred to in Articles L. 1121-5 to L. 1121-8 and L. 1122-1-2 of the French Public Health Code)

Annotated entities:
- Observation: "Vulnerable patients"
- Qualifier: "Articles L. 1121-5 to L. 1121-8 and L. 1122-1-2 of the French Public Health Code"